Self-reported difficulty or inability to perform basic ADL functions (from Q 10, 13, 14, 16 on PAT-D)

The above is a clinical trial exclusion criterion. Annotated with entity spans:
[Non-query-able: Self-reported difficulty or inability to perform basic ADL functions (from Q 10, 13, 14, 16 on PAT-D)]